Clinical trial inclusion criteria:
biopsy proven NASH
Type 2 DM
HbA1c :>6.5%
BMI < 45kg/m2
Any anti-diabetic agent except SGLT2 inhibitors, TZDs(thiazolidinediones), DPP4(Dipeptidyl peptidase4) inhibitors and GLP1 RAs(Glucagon-like Peptide 1-Receptor Agonists)

Annotated entities:
- Condition: "NASH"
- Procedure: "biopsy"
- Condition: "Type 2 DM"
- Measurement: "HbA1c"
- Value: ">6.5%"
- Measurement: "BMI"
- Value: "< 45kg/m2"
- Drug: "anti-diabetic agent"
- Negation: "except"
- Drug: "SGLT2 inhibitors"
- Drug: "TZDs"
- Drug: "thiazolidinediones"
- Drug: "DPP4 inhibitors"
- Drug: "Dipeptidyl peptidase4 inhibitors"
- Drug: "GLP1 RAs"
- Drug: "Glucagon-like Peptide 1-Receptor Agonists"